人體血管循環系統中相對阻力（relative resistance）最高的地方為何？
A. aorta
B. coronary arteries
C. arterioles
D. capillaries

正確答案：C. arterioles